有關裸鼠（nude mice）在腫瘤免疫的研究，下列敘述何者錯誤？
A. 裸鼠常用於人類腫瘤實驗室；因為其排斥腫瘤細胞生長能力差
B. 裸鼠中 T 細胞及 B 細胞正常；但是活化機轉不正常，所以免疫力差
C. 裸鼠中自然殺手細胞仍然是具有腫瘤排斥作用
D. 裸鼠中的腫瘤生長較快且免疫監測較弱

正確答案：B. 裸鼠中 T 細胞及 B 細胞正常；但是活化機轉不正常，所以免疫力差